子宮胎盤循環（uteroplacental circulation）最早出現於胚胎發育之何時？
A. 第 6、7 天
B. 第 11、12 天
C. 第 3 週末
D. 第 5 週初

正確答案：B. 第 11、12 天